Clinical trial exclusion criterion:
Known cause of apnea other than apnea of prematurity

Annotated entities:
- Condition: "Known cause of apnea"
- Condition: "apnea of prematurity"
- Negation: "other than"